下列何者不是衛生福利部所轄的財團法人機構？
A. 財團法人董氏基金會
B. 財團法人器官捐贈移植登錄中心
C. 財團法人藥害救濟基金會
D. 財團法人醫院評鑑暨醫療品質策進會

正確答案：A. 財團法人董氏基金會